Clinical trial exclusion criterion:
Subjects with known cardiac abnormalities (atrial septal defects or ventricular septal defects, severe tricuspid valve disease, severe pulmonary hypertension, Ejection fraction < 15%)

Annotated entities:
- Condition: "cardiac abnormalities"
- Condition: "atrial septal defects"
- Condition: "ventricular septal defects"
- Condition: "tricuspid valve disease"
- Qualifier: "severe"
- Condition: "pulmonary hypertension"
- Qualifier: "severe"
- Measurement: "Ejection fraction"
- Value: "< 15%"